Patient whom the surgery is withhold or canceled

The above is a clinical trial exclusion criterion. Annotated with entity spans:
Patient whom the [Procedure: surgery] is [Observation: withhold] or [Observation: canceled]